在照顧瀕臨死亡之終末病人時，若病人家屬看到病人黏膜乾燥而擔心病人口渴或死於脫水時，下列何者是最適宜的處置？
A. 加快靜脈點滴注射
B. 由鼻胃管灌食，補充水分
C. 放置中央靜脈導管（CVP）以評估是否體液不足
D. 向病人家屬解說瀕死末期的脫水並不會造成病人痛苦

正確答案：D. 向病人家屬解說瀕死末期的脫水並不會造成病人痛苦